在肝臟惡性腫瘤之中，下列那一種腫瘤最常出現肝靜脈（hepatic vein）或肝門靜脈（portal vein）的腫瘤浸潤或侵犯？
A. hepatocellular carcinoma
B. hepatoblastoma
C. cholangiocarcinoma
D. metastasis from colon cancer

正確答案：A. hepatocellular carcinoma